Fingolimod is a selective antagonist for which molecule?

Fingolimod is a selective S1P1 functional antagonist by induction of irreversible S1P1 internalization and degradation.